Clinical trial exclusion criterion:
Allergic to penicillin

Annotated entities:
- Condition: "Allergic"
- Drug: "penicillin"